Patients allergic to any medication given in either arm (list medications)

The above is a clinical trial exclusion criterion. Annotated with entity spans:
Patients [Condition: allergic] to any [Drug: medication] given in either arm (list medications)